Clinical trial inclusion criterion:
Expected survival period= 6 months

Entity relations:
- Has_value("Expected survival period", "= 6 month")